No previous blood transfusion

The above is a clinical trial inclusion criterion. Annotated with entity spans:
[Negation: No] [Temporal: previous] [Procedure: blood transfusion]